與位在視網膜顳側（temporal portion of the retina）光感受細胞相聯繫的神經節細胞（ganglion cells），通常投射至視丘那一核區？
A. contralateral lateral geniculate nucleus
B. ipsilateral lateral geniculate nucleus
C. contralateral medial geniculate nucleus
D. ipsilateral medial geniculate nucleus

正確答案：B. ipsilateral lateral geniculate nucleus